Which histone mark is recognized by HP1?

Here, we present structural, energetic, and mutational analyses of the complex between the Drosophila HP1 chromodomain and the histone H3 tail with a methyllysine at residue 9, a modification associated with epigenetic silencing Methylation of histone H3 lysine 9 creates a binding site for HP1 proteins.